一位 60 歲女性病人反覆發生膽道感染多次，經驗性抗生素治療選擇，下列何者最不適合？
A. Ceftriaxone
B. Ciprofloxacin + Metronidazole
C. Cefazolin
D. Piperacillin + Tazobactam

正確答案：C. Cefazolin